With other respiratory diseases: such as active pulmonary tuberculosis, non-tuberculosis mycobacteria (NTM) pulmonary disease, pulmonary aspergillosis, etc.

The above is a clinical trial exclusion criterion. Annotated with entity spans:
With other [Condition: respiratory diseases]: such as [Qualifier: active] [Condition: pulmonary tuberculosis], [Condition: non-tuberculosis mycobacteria] ([Condition: NTM]) pulmonary disease, [Condition: pulmonary aspergillosis], etc.